Clinical trial exclusion criterion:
Chronic hypertension receiving antihypertensive treatment

Entity relations:
- AND("Chronic hypertension", "antihypertensive treatment")